Clinical trial exclusion criterion:
Any condition that may interfere with protocol compliance including current heavy smoking (>20 cigarettes per day or >20 pack-years with active smoking during the last 10 years), regular use of alcohol.

Annotated entities:
- Condition: "heavy smoking"
- Measurement: "cigarettes per day"
- Measurement: "pack-years"
- Condition: "active smoking"
- Temporal: "during the last 10 years"
- Value: ">20"
- Value: ">20"
- Condition: "regular use of alcohol"